Clinical trial inclusion criteria:
Patient meets protocol criteria for diagnosis of IBS-C, abdominal pain, abdominal bloating and abdominal girth

Annotated entities:
- Qualifier: "protocol criteria"
- Condition: "IBS-C"
- Condition: "abdominal pain"
- Condition: "abdominal bloating"
- Condition: "abdominal girth"